Clinical trial exclusion criterion:
severe coronary artery disease, heart failure, kidney failure

Annotated entities:
- Qualifier: "severe"
- Condition: "coronary artery disease"
- Condition: "heart failure"
- Condition: "kidney failure"